下列何者可解釋持續性心衰竭（persisting heart failure）的病人引起腿部或足部水腫的主要原因？
A. 靜脈壓增加
B. 血漿蛋白濃度增加
C. 淋巴流量增加
D. 微血管通透性降低

正確答案：A. 靜脈壓增加